有一新生兒在出生後不久出現呼吸窘迫，聽診發現僅右胸有呼吸聲，腹部凹陷。則最可能的診斷是什麼？
A. 先天性大葉肺氣腫（Congenital lobar emphysema）
B. 先天性囊狀腺瘤狀異常（Congenital cystic adenomatoid malformation）
C. 先天性心臟病（Congenital heart disease）
D. 先天性橫膈疝氣（Congenital diaphragmatic hernia）

正確答案：D. 先天性橫膈疝氣（Congenital diaphragmatic hernia）